Presence of another vaginal infection or STD

The above is a clinical trial exclusion criterion. Annotated with entity spans:
Presence of [Qualifier: another] [Condition: vaginal infection] or [Condition: STD]